Los ovillos neurofibrilares son estructuras anómalas que se observan en pacientes de alzheimer y que constan de:
1. Neuronas en proceso de extinción por acumulaciones de filamentos entrelazados de proteína tau que alteran el transporte de sustancias, en el citoplasma.
2. Depósitos extracelulares que contienen un núcleo de proteína beta-amilácea rodeada de axones y dendritas en degeneración.
3. Proteínas que sirven para facilitar la producción y transporte de un factor neurotrópico cerebral.
4. Acumulación de astrocitos y microgliocitos con la capacidad de reaccionar ante agentes patógenos externos.
5. Proteínas producidas por un gen defectuoso que aumenta la probabilidad de la enfermedad de Parkinson.

Respuesta correcta: 1. Neuronas en proceso de extinción por acumulaciones de filamentos entrelazados de proteína tau que alteran el transporte de sustancias, en el citoplasma.